Lactante de 4 meses de edad (6,280 Kg) que acude al Servicio de Urgencias Pediátricas con cuadro de diarrea aguda de 24 horas de evolución, con heces acuosas sin sangre ni moco y signos de deshidratación ligera-moderada. Recibe lactancia materna exclusiva. Su madre refiere que no ha vomitado, que realiza las tomas con avidez y que está irritable. La terapéutica de elección para el manejo de este lactante consistiría en:
1. Interrupción temporal de la lactancia materna y rehidratación parenteral con solución salina normal durante las primeras 4 horas o hasta que los signos de deshidratación hayan desaparecido. Se administrará un inhibidor de la motilidad intestinal.
2. Rehidratación oral con solución de baja osmolaridad en tomas frecuentes de bajo volumen, asegurando entre 50-100 ml/kg durante 3-4 horas, reposición de las pérdidas mantenidas y manteniendo de la lactancia materna.
3. Rehidratación oral con solución de baja osmolaridad en tomas frecuentes de bajo volumen asegurando aportes entre 15-30 ml/kg durante 4 horas para reponer déficit y 10 ml/kg por deposición, y administración de fórmula sin lactosa.
4. Carga parenteral con solución glucosalina a 10-15 ml/kg en 30 minutos, rehidratación oral con solución de alta osmoralidad asegurando aportes entre 75-100 ml/kg en las primeras 4 horas y mantenimiento de la lactancia materna a demanda.

Respuesta correcta: 2. Rehidratación oral con solución de baja osmolaridad en tomas frecuentes de bajo volumen, asegurando entre 50-100 ml/kg durante 3-4 horas, reposición de las pérdidas mantenidas y manteniendo de la lactancia materna.